Clinical trial inclusion criteria:
1. Age ≥ 18 years
2. Patient with breast cancer, histologically proven, metastatic or locally advanced
3. Patient treated by Eribulin between January and October 2014 (for the retrospective part) or between November 2014 and September 2015 (for the prospective part).
4. Patient with at least an assessment of the response to Eribulin

Annotated entities:
- Parsing_Error: "1."
- Person: "Age"
- Value: "≥ 18 years"
- Parsing_Error: "2."
- Condition: "breast cancer"
- Procedure: "histologically"
- Value: "proven"
- Qualifier: "metastatic"
- Qualifier: "locally advanced"
- Parsing_Error: "3."
- Drug: "Eribulin"
- Temporal: "between January and October 2014"
- Temporal: "between November 2014 and September 2015"
- Parsing_Error: "4."
- Drug: "Eribulin"
- Procedure: "assessment of the response"
- Non-query-able: "Patient with at least an assessment of the response to Eribulin"